氣管分岔處（carina）在胸部 X 光所在的高度約相應於脊椎那一個部位？
A. C6
B. T1-2
C. T4-5
D. L2-3

正確答案：C. T4-5